Clinical trial inclusion criterion:
HIV controlled on therapy for at least 12 weeks

Entity relations:
- Has_qualifier("HIV", "controlled")
- Has_temporal("HIV", "at least 12 weeks")